Has documented objective radiographic progression during or after treatment with sorafenib or oxaliplatin-based chemotherapy, or else intolerance to sorafenib or oxaliplatin-based chemotherapy

The above is a clinical trial inclusion criterion. Annotated with entity spans:
Has documented [Observation: objective] [Procedure: radiographic] progression [Temporal: during or after] [Reference_point: treatment with sorafenib or oxaliplatin-based chemotherapy], or else [Condition: intolerance] to [Qualifier: sorafenib or oxaliplatin-based] [Procedure: chemotherapy]